En relación a las vacunas, señale la opción correcta:
1. El calendario vacunal debe suspenderse durante los meses de verano.
2. El calendario vacunal es fijo e inamovible.
3. La temperatura adecuada de almacenamiento está comprendida entre los 2 y los 8C.
4. La vacuna antigripal sólo debe administrarse a mayores de 14 años.
5. Todas las respuestas anteriores son correctas.

Respuesta correcta: 3. La temperatura adecuada de almacenamiento está comprendida entre los 2 y los 8C.